以下何種反應不是典型的 stress response？
A. 血糖上升
B. 血壓上升
C. 瞳孔縮小
D. 汗腺分泌增加

正確答案：C. 瞳孔縮小